Congenital uterine malformation.

The above is a clinical trial exclusion criterion. Annotated with entity spans:
[Condition: Congenital uterine malformation].